Clinical trial inclusion criterion:
Renal function, as follows: Creatinine <=1.5 x upper limit of normal (ULN).

Annotated entities:
- Measurement: "Creatinine"
- Value: "<=1.5 x upper limit of normal (ULN)"